Clinical trial inclusion criterion:
indication for osteoporosis therapy according to international guidelines

Annotated entities:
- Mood: "indication for"
- Procedure: "osteoporosis therapy"
- Condition: "osteoporosis"
- Qualifier: "international guidelines"